Clinical trial exclusion criterion:
Use of any prescription or over-the-counter medication, herbal medication, vitamins, or mineral supplements within 14 days prior to study drug administration (not including paracetamol). Medication for chronic use in age related disease will be allowed after approval by both the investigator and to the sponsor. No change in dose or regimen will be permitted during the study that is, from the Screening visit until the follow-up visit

Entity relations:
- Has_index("within 14 days prior to study drug administration", "study drug administration")
- Has_negation("paracetamol", "not")
- AND("any prescription", "paracetamol")
- Has_temporal("any prescription", "within 14 days prior to study drug administration")
- Has_multiplier("Medication", "chronic use")
- AND("Medication", "age related disease")
- OR("any prescription", "mineral supplements", "herbal medication", "over-the-counter medication", "vitamins")